Clinical trial exclusion criterion:
Other serious underlying medical conditions which could impair the ability of the patient to participate in the study

Entity relations:
- AND("ability of the patient to participate", "serious medical conditions")